Clinical trial exclusion criterion:
Evident local or pelvic recurrence

Annotated entities:
- Condition: "pelvic recurrence"
- Condition: "local recurrence"